Clinical trial inclusion criterion:
Psychiatrically stable enough to attend to completion (no hospitalisations or medication changes in last 4 weeks)

Annotated entities:
- Condition: "Psychiatrically stable"
- Procedure: "hospitalisations"
- Negation: "no"
- Observation: "medication changes"
- Temporal: "in last 4 weeks"